Adults = 18 years of age

The above is a clinical trial inclusion criterion. Annotated with entity spans:
[Person: Adults] [Value: = 18 years] of [Person: age]